Clinical trial exclusion criterion:
Subjects who can not stop treatment with topical steroids (group 1~5), oral antibiotics, whole body photochemotherapy, immunosuppressive drug within 4 weeks before the treatment visit

Entity relations:
- Has_index("within 4 weeks before", "treatment visit")
- AND("topical steroids", "can not stop")
- Has_temporal("can not stop", "within 4 weeks before")
- OR("topical steroids", "oral antibiotics", "whole body photochemotherapy", "immunosuppressive drug")